幽門螺旋桿菌感染不會增加下列何項疾病的風險？
A. reflux esophagitis
B. non-cardiac gastric cancer
C. gastric mucosa-associated lymphoid tissue（MALT）lymphoma
D. gastric ulcer

正確答案：A. reflux esophagitis